Patient is aged greater than or equal to 40 and less than or equal to 89 years of age

The above is a clinical trial inclusion criterion. Annotated with entity spans:
Patient is [Person: aged] [Value: greater than or equal to 40] and [Value: less than or equal to 89 years] of age